Clinical trial exclusion criteria:
Allergy or contraindication to paracetamol, Prasugrel or Ticagrelor
Paracetamol ingestion in the previous 48 hours
Patient treated with drugs supposed to alter gastric emptying times (calcium antagonists, Alimentary tract treatments, opioid analgesics, tricyclic antidepressants, antibiotics).
Conditions or pathologies supposed to alter gastric emptying times (Thyroid dysfunction, chronic renal failure, Parkinson's disease, scleroderma, amyloidosis, any gastrointestinal disease, any not cured malignancy, and any advanced psychiatric or neurological disease).
Presence of vomiting
Cardiogenic shock, ventricular arrhythmia or resuscitated cardiac arrest
Hepatic insufficiency
Severe respiratory disease
Pregnant or breastfeeding women

Annotated entities:
- Condition: "Allergy"
- Condition: "contraindication"
- Drug: "paracetamol"
- Drug: "Prasugrel"
- Drug: "Ticagrelor"
- Drug: "Paracetamol"
- Temporal: "in the previous 48 hours"
- Drug: "calcium antagonists"
- Procedure: "Alimentary tract treatments"
- Drug: "opioid analgesics"
- Drug: "tricyclic antidepressants"
- Drug: "antibiotics"
- Drug: "drugs supposed to alter gastric emptying times"
- Condition: "Thyroid dysfunction"
- Condition: "chronic renal failure"
- Condition: "Parkinson's disease"
- Condition: "scleroderma"
- Condition: "amyloidosis"
- Condition: "gastrointestinal disease"
- Condition: "malignancy"
- Condition: "psychiatric disease"
- Condition: "neurological disease"
- Qualifier: "advanced"
- Condition: "pathologies supposed to alter gastric emptying times"
- Condition: "Conditions supposed to alter gastric emptying times"
- Condition: "vomiting"
- Condition: "Cardiogenic shock"
- Condition: "ventricular arrhythmia"
- Condition: "cardiac arrest"
- Qualifier: "resuscitated"
- Condition: "Hepatic insufficiency"
- Condition: "respiratory disease"
- Qualifier: "Severe"
- Condition: "Pregnant"
- Observation: "breastfeeding"
- Person: "women"